reported heart condition

The above is a clinical trial exclusion criterion. Annotated with entity spans:
reported [Condition: heart condition]